下列有關isoflurane可造成病人不動（immobility）的藥理機制之敘述，何者錯誤？
A. 主要是作用於脊髓（spinal cord），不是作用於大腦
B. 需要比引起失去意識狀態還高的isoflurane濃度才能引起immobility
C. 主要透過作用於GABA接受器達到immobility的作用
D. 與isoflurane抑制nocifensive withdrawal reflex arc有關

正確答案：C. 主要透過作用於GABA接受器達到immobility的作用